Clinical trial inclusion criterion:
8. Persistent chronic clinically significant non-hematological toxicities from prior treatment must be ≤Grade 1.

Annotated entities:
- Condition: "toxicities"
- Qualifier: "non-hematological"
- Qualifier: "clinically significant"
- Temporal: "prior"
- Qualifier: "≤Grade 1"
- Value: "≤Grade 1"
- Qualifier: "from prior treatment"
- Procedure: "treatment"